HbA1c < 8.5%

The above is a clinical trial inclusion criterion. Annotated with entity spans:
[Measurement: HbA1c] [Value: < 8.5%]